Please list 2 antitoxin antibodies approved by the FDA for reducing the recurrence of Clostridium difficile infection

The antitoxin antibodies actoxumab and bezlotoxumab bind to and neutralize TcdA and TcdB, respectively. Bezlotoxumab was recently approved by the FDA for reducing the recurrence of CDI.